La meta de “Salud Para Todos en el Año 2000” se propuso por primera vez en:
1. El Compendio Internacional de Indicadores de Salud (1999).
2. La Carta de Ottawa (1986).
3. La Segunda Conferencia de Promoción de la Salud de Adelaida (1988).
4. La Declaración de Yakarta (1997).
5. La Conferencia de Alma-Ata (1978).

Respuesta correcta: 5. La Conferencia de Alma-Ata (1978).